History of thrombocytopenia induced by heparin

The above is a clinical trial exclusion criterion. Annotated with entity spans:
History of [Condition: thrombocytopenia] induced by [Drug: heparin]